Clinical trial exclusion criterion:
Concurrent medication from Visit 1 and for the duration of the study with any of the prohibited medications: monoamine oxidase inhibitors and tricyclic antidepressants, and ritonavir (a highly potent cytochrome P450 3A4 inhibitor).

Annotated entities:
- Drug: "medication from Visit 1"
- Drug: "monoamine oxidase inhibitors"
- Drug: "tricyclic antidepressants"
- Drug: "ritonavir"
- Drug: "cytochrome P450 3A4 inhibitor"